El número de cadenas de la IgG es:
1. 1.
2. 2.
3. 3.
4. 4.
5. 5.

Respuesta correcta: 4. 4.